Gestational age = 37 weeks,

The above is a clinical trial inclusion criterion. Annotated with entity spans:
[Measurement: Gestational age] [Value: = 37 weeks],